Clinical trial inclusion criterion:
Referred for STEMI within 6 hours from beginning of chest pain or stable coronary artery disease requiring a loading dose of Prasugrel or Ticagrelor according to the international recommendations.

Annotated entities:
- Condition: "STEMI"
- Multiplier: "loading dose"
- Drug: "Prasugrel"
- Drug: "Ticagrelor"
- Temporal: "within 6 hours from beginning of chest pain"
- Reference_point: "beginning of chest pain"
- Condition: "coronary artery disease"
- Qualifier: "stable"
- Condition: "chest pain"